Clinical trial exclusion criterion:
Patients on renal dialysis or with end-stage hepatic dysfunction

Annotated entities:
- Procedure: "renal dialysis"
- Condition: "end-stage hepatic dysfunction"